Clinical trial inclusion criterion:
ECOG performance status of 2 or lower

Annotated entities:
- Measurement: "ECOG performance status"
- Value: "2 or lower"